70歲女性，因停經後陰道出血至門診求診，最常見的原因為何？
A. 子宮內膜癌
B. 子宮內膜增生
C. 子宮肌瘤
D. 萎縮性子宮內膜

正確答案：D. 萎縮性子宮內膜